Clinical trial inclusion criterion:
Progression on prior therapy with a hormonal agent if estrogen receptor or progesterone receptor positive, and/or with trastuzumab if HER2-neu positive. If patient has progressed through hormone or trastuzumab therapy only, must have received one chemotherapy regimen.

Entity relations:
- AND("estrogen receptor positive", "therapy with a hormonal agent")
- AND("HER2-neu positive", "therapy with trastuzumab")
- Has_temporal("therapy with a hormonal agent", "prior")
- Has_temporal("therapy with trastuzumab", "prior")
- Has_context("estrogen receptor positive", "Progression on")
- Has_context("hormone therapy", "progressed through")
- Has_context("hormone therapy", "progressed through")
- Has_context("trastuzumab therapy", "progressed through")
- AND("hormone therapy", "chemotherapy regimen")
- OR("estrogen receptor positive", "progesterone receptor positive")
- OR("estrogen receptor positive", "HER2-neu positive")
- OR("hormone therapy", "trastuzumab therapy")